Clinical trial exclusion criterion:
Amnestic and other cognitive disorder;

Entity relations:
- OR("Amnestic disorder", "cognitive disorder")